六十歲的飯店老板陳先生最近有輕微中風，頸動脈超音波無明顯狹窄，心電圖發現有心房震顫（atrial fibrillation），請問使用何種藥物預防再次中風最有效益？
A. Aspirin
B. Ticlopidine
C. Warfarin
D. Clopidogrel

正確答案：C. Warfarin